Clinical trial exclusion criterion:
Failure to have fully recovered (that is, less than or equal to [<=] Grade 1 toxicity) from the reversible effects of prior chemotherapy.

Entity relations:
- Has_negation("fully recovered", "Failure")
- Has_value("toxicity", "less than or equal to [<=] Grade 1")
- Subsumes("fully recovered", "toxicity")
- AND("chemotherapy", "fully recovered")